Clinical trial exclusion criterion:
Popliteal artery stenosis >50% at P2 or P3 segment

Annotated entities:
- Condition: "Popliteal artery stenosis"
- Value: ">50%"
- Qualifier: "P2 or P3 segment"